Which was the first genetically modified organism (GMO) to be used as vaccine?

The first genetically modified organism to be used as vaccine was the live oral cholera vaccine CVD 103-HgR or vaxchora.